Contra-indication to Brimonidine including patients on monoamine oxidase inhibitors (MOA)

The above is a clinical trial exclusion criterion. Annotated with entity spans:
[Condition: Contra-indication] to [Drug: Brimonidine] including patients on [Drug: monoamine oxidase inhibitors] ([Drug: MOA])